Known intolerance or contraindication to ticagrelor or ASA

The above is a clinical trial exclusion criterion. Annotated with entity spans:
Known [Condition: intolerance] or [Condition: contraindication] to [Drug: ticagrelor] or [Drug: ASA]